有關骨肉瘤（osteosarcoma）的敘述，下列何者正確？
A. 此腫瘤好發於年輕人及老年人，他們的發生率相當
B. 在成人，此腫瘤主要是發生在長骨（long bone），發生在平骨（flat bone）的機率約為長骨的一半
C. 腫瘤細胞除產生骨母質（bone matrix）外，亦可產生軟骨母質（cartilage matrix）
D. 在長骨的好發部位為骺部（epiphyseal region）

正確答案：C. 腫瘤細胞除產生骨母質（bone matrix）外，亦可產生軟骨母質（cartilage matrix）